¿En qué tipo de tareas se manifiestan especialmente los problemas atencionales característicos del trastorno por déficit de atención con hiperactividad?
1. Tareas simples, novedosas y de focalización.
2. Tareas complejas, novedosas y de capacidad.
3. Tareas simples, rutinarias y de selección.
4. Tareas complejas, novedosas y de organización.
5. Tareas complejas, rutinarias y de vigilancia.

Respuesta correcta: 5. Tareas complejas, rutinarias y de vigilancia.